Clinical symptoms suggestive of pharyngitis with MC Isaac score =3

The above is a clinical trial inclusion criterion. Annotated with entity spans:
[Mood: Clinical symptoms suggestive of] [Condition: pharyngitis] with [Measurement: MC Isaac score] [Value: =3]